patient hospitalized in critical care units

The above is a clinical trial inclusion criterion. Annotated with entity spans:
patient [Procedure: hospitalized] in [Visit: critical care units]